Clinical trial exclusion criterion:
Current severe illness, including heart, liver and renal failure, major organ allograft, malignancy requiring parenteral chemotherapy that can not be discontinued for the duration of the trial, or any other conditions which, in the opinion of the Investigator, would make the patient unsuitable for the study.

Entity relations:
- AND("malignancy", "chemotherapy")
- OR("heart failure", "liver failure", "major organ allograft", "malignancy", "renal failure")